Clinical trial exclusion criterion:
HIV+ patients

Annotated entities:
- Condition: "HIV+"
- Measurement: "HIV"
- Value: "+"